List bacteria that may be useful in uranium bioremediation.

The main bacteria studied in uranium bioremediation are Geobacteraceae. Other bacteria are: 
Firmicutes, 
Shewanella oneidensis
Pseudomonas aeruginosa
Anaeromyxobacter dehalogenans  
strain Rf4T